Subject with a history of myocardial infarction, stroke or life-threatening arrhythmia within 6 months prior to screening

The above is a clinical trial exclusion criterion. Annotated with entity spans:
Subject with a history of [Condition: myocardial infarction], [Condition: stroke] or [Qualifier: life-threatening] [Condition: arrhythmia] [Temporal: within 6 months prior to screening]